Clinical trial exclusion criteria:
Females who have high response (estradiol at time of ovulation trigger is > 5000 pg/ml or more than 15 oocytes are retrieved)

Annotated entities:
- Condition: "high response"
- Person: "Females"
- Measurement: "estradiol"
- Temporal: "at time of ovulation trigger"
- Reference_point: "ovulation trigger"
- Value: "> 5000 pg/ml"
- Value: "more than 15"
- Measurement: "oocytes retrieved"